Clinical trial exclusion criterion:
6. Any serious, active infection (> Grade 2) at the time of treatment.

Annotated entities:
- Condition: "infection"
- Value: "> Grade 2"
- Qualifier: "> Grade 2"
- Qualifier: "serious"
- Temporal: "active"
- Subjective_judgement: "serious"